下列何者是發生在成年人上眼瞼結膜上的巨大乳頭狀結膜炎（giant papillary conjunctivitis），最常見的原因？
A. 配戴隱型眼鏡
B. 維他命 A 缺乏
C. 糖尿病
D. 頸動脈靜脈竇管（carotid-cavernous fistula）

正確答案：A. 配戴隱型眼鏡